Clinical trial exclusion criterion:
Body weight > 140 kg

Annotated entities:
- Measurement: "Body weight"
- Value: "> 140 kg"